70 歲男性，過去 40 年一天抽一包菸，最近三個月體重下降 6 公斤，痰液中帶有少許血絲。理學檢查看來病人瘦弱，有杵狀指（clubbing finger），胸腔前後徑變長，胸腔聽診兩側肺野有散在性喘鳴音（wheezing），心音聽起來遙遠微弱。胸腔 X 光片有左側肺門淋巴病變，橫膈膜變平坦。痰液細胞學顯示深嗜伊紅（eosinophilic staining）細胞質以及大小不規則、深染（hyperchromatic）細胞核。此病人最可能的診斷為何？
A. 肺結核（tuberculosis）
B. 小細胞肺癌（small cell lung cancer）
C. 支氣管擴張（bronchiectasis）
D. 非小細胞肺癌（non-small cell lung cancer）

正確答案：D. 非小細胞肺癌（non-small cell lung cancer）